下列何者由輸尿管芽（ureteric bud）形成？
A. 鮑氏囊（Bowman's capsule）
B. 近曲小管（proximal convoluted tubule）
C. 絲球體（glomerulus）
D. 集尿小管（collecting tubule）

正確答案：D. 集尿小管（collecting tubule）